Clinical trial inclusion criterion:
body mass index < 46 kg/m2

Entity relations:
- Has_value("body mass index", "< 46 kg/m2")